Clinical trial exclusion criterion:
Severe mitral regurgitation (Regurgitant volume = 60 mL/beat, Regurgitant fraction = 50%, and/or Effective regurgitant orifice area = 0.40cm2)

Entity relations:
- Has_qualifier("mitral regurgitation", "Severe")
- Has_value("Regurgitant volume", "= 60 mL/beat")
- Has_value("Regurgitant fraction", "= 50%")
- Has_value("Effective regurgitant orifice area", "= 0.40cm2")
- AND("mitral regurgitation", "Regurgitant volume")
- OR("Regurgitant volume", "Effective regurgitant orifice area", "Regurgitant fraction")